¿Cuál es el rendimiento neto del catabolismo de 1 mol de glucosa por glucólisis anaerobia?:
1. Dos moles de lactato y dos moles de ATP.
2. Dos moles de lactato, dos moles de NADH y dos moles de ATP.
3. Dos moles de lactato, dos moles de NAD+ y dos moles de ATP.
4. Dos moles de piruvato y dos moles de ATP.

Respuesta correcta: 1. Dos moles de lactato y dos moles de ATP.